Clinical trial exclusion criterion:
Incompletely cured pre-existing diseases for which it can be assumed that the absorption, distribution, metabolism, elimination or effects of the study drugs will not be normal

Entity relations:
- Has_qualifier("pre-existing diseases", "Incompletely cured")